Clinical trial inclusion criterion:
Patients with symptomatic FAI

Entity relations:
- Has_qualifier("FAI", "symptomatic")